Medical or psychiatric conditions comprising informed consent.

The above is a clinical trial exclusion criterion. Annotated with entity spans:
[Subjective_judgement: Medical or psychiatric conditions comprising informed consent].